Clinical trial exclusion criterion:
smoked within the past year

Annotated entities:
- Observation: "smoked"
- Temporal: "within the past year"